Los indicadores ácido-base tienen un intervalo de viraje de aproximadamente dos unidades de pH debido a que:
1. Para pasar de la forma ácida a la básica o viceversa, tiene que formarse primero un producto de reacción intermedio, incoloro.
2. Las constantes de la disociación ácida de los compuestos orgánicos usados como indicadores, son muy bajas y es necesario añadir un exceso de valorante.
3. La cinética de la reacción de neutralización de estos compuestos es lenta.
4. Es preciso que exista un cierto exceso de la forma coloreada para observar el cambio.

Respuesta correcta: 4. Es preciso que exista un cierto exceso de la forma coloreada para observar el cambio.